Clinical trial exclusion criterion:
2 target lesions in the same coronary territory

Entity relations:
- Has_qualifier("target lesions", "in the same coronary territory")
- Has_multiplier("target lesions", "2")